Clinical trial exclusion criterion:
Congenital or acquired thrombophilia/thrombosis event

Annotated entities:
- Qualifier: "Congenital"
- Qualifier: "acquired"
- Condition: "thrombophilia"
- Condition: "thrombosis event"